患有精神疾病之家庭主婦D，因急性腹痛數天，被家屬帶至急診求助，經外科醫師診斷為急性闌尾炎併發之急性腹膜炎。外科醫師完善告知D及其家屬關於D之病情後，建議緊急開刀，然而D確信自己乃是造成世界災難的罪人，應該以死贖罪，拒絕接受任何勸說及解釋，亦拒絕簽署手術同意書及麻醉同意書。外科醫師照會精神科醫師P，P應作何處理或建議，較為恰當？
A. 建議外科醫師尊重D不接受手術之自主決定
B. P應以心理治療之技巧，勸D接受手術
C. D之醫療決定能力受其精神疾病之影響，脫離現實，無同意或拒絕手術之意思能力，P應建議由其家屬代為簽署手術同意書及麻醉同意書
D. 建議外科醫師給予D抗精神病藥物，待D之妄想消解之後，再勸其接受手術

正確答案：C. D之醫療決定能力受其精神疾病之影響，脫離現實，無同意或拒絕手術之意思能力，P應建議由其家屬代為簽署手術同意書及麻醉同意書